Clinical trial inclusion criterion:
fasting plasma glucose (FPG) =126 mg/dL (7.0 mmol/L)

Entity relations:
- Subsumes("=126 mg/dL", "7.0 mmol/L")
- Has_value("fasting plasma glucose (FPG)", "=126 mg/dL")